大學生騎機車不幸發生車禍，造成左小腿複雜性骨折，經開刀固定後，病情穩定。數日後胸痛、呼吸困難，轉入加護病房，其診斷最可能為：
A. 敗血症
B. 肺栓塞
C. 顱內出血
D. 細菌性肺炎

正確答案：B. 肺栓塞